10. Severe anemia (hemoglobin <8 g/dL)

The above is a clinical trial exclusion criterion. Annotated with entity spans:
10. [Qualifier: Severe] [Condition: anemia] ([Measurement: hemoglobin] [Value: <8 g/dL])